Significant, non-reversible active pulmonary disease (e.g. cystic fibrosis, bronchiectasis, tuberculosis).

The above is a clinical trial exclusion criterion. Annotated with entity spans:
[Qualifier: Significant], [Qualifier: non-reversible] [Temporal: active] [Condition: pulmonary disease] (e.g. [Condition: cystic fibrosis], [Condition: bronchiectasis], [Condition: tuberculosis]).